Clinical trial exclusion criterion:
History of developmental disorder or IQ score < 70

Entity relations:
- Has_value("IQ score", "< 70")
- OR("developmental disorder", "IQ score")